Body mass index (BMI) < 18.5 kg/m2 or > 25 kg/m2.

The above is a clinical trial exclusion criterion. Annotated with entity spans:
[Measurement: Body mass index] ([Measurement: BMI]) [Value: < 18.5 kg/m2] or [Value: > 25 kg/m2].